一位 3 歲男孩原本會跑步但近四個月發現越來越不能走路，一週前發現他蹲下去後需靠雙手撐住地面才能站起來，血清中肌酸激酶（creatine kinase）為正常值的 100 倍。他最可能是得到下列何種疾病？
A. Duchenne muscular dystrophy
B. spinal muscular atrophy
C. congenital muscular dystrophy
D. myasthenia gravis

正確答案：A. Duchenne muscular dystrophy